Clinical trial exclusion criterion:
Known severe heart failure, classified as NYHA 4.

Annotated entities:
- Condition: "heart failure"
- Qualifier: "severe"
- Measurement: "NYHA"
- Value: "4"